What molecule is targeted by brodalumab?

Interleukin-17. Brodalumab is anti interleukin-17 monoclonal antibody.